Contraindication for IAP measurement in supine position with head-of-bed at 0°

The above is a clinical trial exclusion criterion. Annotated with entity spans:
[Condition: Contraindication] for [Procedure: IAP measurement] in [Qualifier: supine position] with [Qualifier: head-of-bed at 0°]